Clinical trial exclusion criterion:
• Bacille Calmette-Guerin (BCG) vaccination (12 months off drug)

Entity relations:
- Has_temporal("Bacille Calmette-Guerin (BCG) vaccination", "12 months off drug")